Patients who have been monitored without complication such as acute rejection.

The above is a clinical trial inclusion criterion. Annotated with entity spans:
Patients who have been monitored [Negation: without] [Condition: complication] such as [Condition: acute rejection].